下列何構造是位於會陰淺凹內（superficial perineal pouch）？①陰莖根（root of penis）②球尿道腺 （bulborethral gland） ③大前庭腺（greater vestibular gland） ④坐骨海綿體肌（ischiocavernosus muscle） ⑤尿道外括約肌（external urethral sphincter muscle）
A. ①②③
B. ①③④
C. ②③⑤
D. ②④⑤

正確答案：B. ①③④